Clinical trial exclusion criterion:
7. The subject has a concurrent chronic or acute illness, disability, or other condition (including significant unexpected laboratory or electrocardiogram [ECG] findings) that might confound the results of the tests and/or measurements administered in this study, or that might have increased the risk to the subject.

Entity relations:
- OR("chronic illness", "disability", "other condition", "acute illness")